踩到玻璃劃破足底外側動脈（lateral plantar artery）造成出血，如果採用加壓止血法，按壓下列何處最為適當？
A. 股三角（femoral triangle）
B. 膕窩（popliteal fossa）
C. 跗骨隧道（tarsal tunnel）
D. 足背（dorsalis pedis）

正確答案：C. 跗骨隧道（tarsal tunnel）